Clinical trial inclusion criterion:
5. ANC greater than 500/µL.

Annotated entities:
- Parsing_Error: "5."
- Measurement: "ANC"
- Value: "greater than 500/µL"